Clinical trial inclusion criterion:
SCI ( =1 month of injury)

Annotated entities:
- Condition: "SCI"
- Temporal: "=1 month of injury"